下列何者分泌穆勒氏抑制物（Müllerian inhibiting substance, MIS），使副中腎管（paramesonephric duct）退化？
A. 睪丸支持細胞（Sertoli cell）
B. 睪丸間質細胞（Leydig cell）
C. 原始生殖細胞（primordial germ cell）
D. 濾泡細胞（follicular cell）

正確答案：A. 睪丸支持細胞（Sertoli cell）